Beck's Depression Inventory (BDI) =14

The above is a clinical trial exclusion criterion. Annotated with entity spans:
[Measurement: Beck's Depression Inventory (BDI)] [Value: =14]